Slowed heart rate, causing symptoms (symptomatic bradycardia),

The above is a clinical trial exclusion criterion. Annotated with entity spans:
[Qualifier: Slowed] [Condition: heart rate], causing [Condition: symptoms] ([Qualifier: symptomatic] [Condition: bradycardia]),